同質異化基因（homeotic genes）在果蠅胚胎發育期（developmental stages）主要扮演何種角色？
A. 基因在產卵期時開始作轉錄表現，其mRNA在卵中呈休眠狀態直到受精後才被啟動
B. 在胚胎發育後期表現，決定每一體節的詳細結構
C. 決定翅膀的基因總稱
D. 決定眼睛顏色的基因總稱

正確答案：B. 在胚胎發育後期表現，決定每一體節的詳細結構